Clinical trial exclusion criterion:
Head trauma within the previous two weeks

Entity relations:
- Has_temporal("Head trauma", "within the previous two weeks")